¿Para cuáles de las siguientes configuraciones se dan las situaciones de campo fuerte o espín bajo y campo débil o espín alto?:
1. d1 y d2.
2. d3 y d4.
3. d5 y d6.
4. d7 y d8.

Respuesta correcta: 3. d5 y d6.